Clinical trial exclusion criterion:
Having plan to be pregnant;

Annotated entities:
- Mood: "plan"
- Condition: "pregnant"